Clinical trial inclusion criteria:
After the investigator has taken the decision to use human insulin or insulin analogues to treat the subject, any type 2 diabetic previously inadequately controlled with two or more OADs is eligible for the study
The selection of the subjects will be at the discretion of the individual investigator

Annotated entities:
- Condition: "type 2 diabetic"
- Qualifier: "inadequately controlled"
- Temporal: "previously"
- Multiplier: "two or more"
- Condition: "OADs"
- Non-representable: "After the investigator has taken the decision to use human insulin or insulin analogues to treat the subject"
- Non-representable: "The selection of the subjects will be at the discretion of the individual investigator"